Overweight or obesity (BMI =25 kg/m2)

The above is a clinical trial inclusion criterion. Annotated with entity spans:
[Condition: Overweight] or [Condition: obesity] ([Measurement: BMI] [Value: =25 kg/m2])